下列何者降低時，可增加淋巴的流速？
A. 微血管靜水壓（hydrostatic pressure）
B. 微血管通透性（permeability）
C. 血漿膠體滲透壓（colloid osmotic pressure）
D. 組織間液膠體滲透壓（colloid osmotic pressure）

正確答案：C. 血漿膠體滲透壓（colloid osmotic pressure）